Clinical trial inclusion criteria:
presence of stress urinary or urgency incontinence

Annotated entities:
- Condition: "urgency incontinence"
- Condition: "stress urinary incontinence"